La ADH aumenta la osmolaridad del medio intersticial renal porque aumenta:
1. La permeabilidad a la urea en el tubo colector.
2. La permeabilidad al agua del asa ascendente de Henle.
3. El flujo en los vasos rectos.
4. La reabsorción de NaCl en el túbulo colector.
5. La excreción renal de agua.

Respuesta correcta: 1. La permeabilidad a la urea en el tubo colector.